Clinical trial exclusion criterion:
7. History of subarachnoid hemorrhage

Annotated entities:
- Condition: "subarachnoid hemorrhage"
- Temporal: "History"